Clinical trial exclusion criterion:
Severe disease with a life expectancy of less than 3 months;

Annotated entities:
- Observation: "life expectancy"
- Value: "less than 3 months"
- Condition: "disease"
- Qualifier: "Severe"